What is the most common N6-methyladenosine (m6A) methylation modification site of RUNX1T1?

The RRACH motif is the most common N6-methyladenosine (m6A) methylation modification site of RUNX1T1.